一位58歲女性病人，因為2天前開始頻尿、小便灼熱感、小腹覺得有輕微脹痛感，有時覺得尿不太出來，今天開始出現血尿，沒有血塊，則下列何者錯誤？
A. 最可能的診斷是急性細菌性膀胱炎
B. 絕大多數社區型感染之病原菌是大腸桿菌（E. coli）
C. 應該安排膀胱鏡檢查
D. 在門診很常見，典型的病例並不一定要做尿液細菌培養

正確答案：C. 應該安排膀胱鏡檢查